Inability to communicate in the preoperative period because of coma, profound dementia or language barrier;

The above is a clinical trial exclusion criterion. Annotated with entity spans:
[Condition: Inability to communicate] in the [Temporal: preoperative period] because of [Condition: coma], [Qualifier: profound] [Condition: dementia] or [Observation: language barrier];